What is the target of adalimumab?

adalimumab is an anti-tumour necrosis factor (tf)-α antibody.